一位慣用左手之 28 歲男性，因頸部疼痛，到坊間接受整脊，經過 20 分鐘之整脊過程，頸痛惡化及注意到左臉麻木，以及出現左側肢體笨拙（clumsiness），下列那一項是最有可能之診斷？
A. 基底動脈栓塞（Basilar artery thrombosis）
B. 頸部椎間盤突出（Cervical disc protrusion）
C. 頸動脈狹窄（Carotid stenosis）
D. 脊椎動脈剝離（Vertebral artery dissection）

正確答案：D. 脊椎動脈剝離（Vertebral artery dissection）